Where is the klotho protein primarily expressed in the body

Klotho is primarily expressed in the kidney but also in the brain, lens of the eye, and heart.